¿Cuál de las siguientes enfermedades cutáneas está asociada con la enfermedad celíaca?
1. Dermatitis atópica.
2. Dermatitis herpetiforme.
3. Moluscum contagioso.
4. Granuloma anular.
5. Rosácea.

Respuesta correcta: 2. Dermatitis herpetiforme.